Clinical trial exclusion criterion:
At Visit 1, receiving ongoing treatment with a duration of more than 2 weeks with prednisone equivalent to >10mg/day

Annotated entities:
- Temporal: "At Visit 1 more than 2 weeks"
- Drug: "prednisone"
- Multiplier: ">10mg/day"
- Reference_point: "Visit 1"